Clinical trial exclusion criterion:
13. Use of an experimental treatment for PBC

Annotated entities:
- Parsing_Error: "13."
- Procedure: "experimental treatment for PBC"
- Undefined_semantics: "experimental treatment for PBC"
- Context_Error: "experimental treatment for PBC"